Clinical trial exclusion criterion:
No history of using 5-ASA, biological or immunomodulatory therapy

Entity relations:
- Has_temporal("5-ASA", "history")
- Has_negation("5-ASA", "No")
- OR("5-ASA", "therapy biological", "immunomodulatory therapy")